Clinical trial inclusion criteria:
Diabetes mellitus
Foot ulcer at the malleoli area between 0,25 cm² and 5,0 cm²
Foot ulcer duration more than 6 weeks
Ankle-brachial index above 0,40 or presence of palpable pulses in arteria dorsalis pedes and/or arteria tibialis posterior
informed consent

Annotated entities:
- Condition: "Diabetes mellitus"
- Condition: "Foot ulcer"
- Qualifier: "malleoli area"
- Value: "between 0,25 cm² and 5,0 cm²"
- Condition: "Foot ulcer"
- Temporal: "more than 6 weeks"
- Measurement: "Ankle-brachial index"
- Value: "above 0,40"
- Condition: "palpable pulses"
- Reference_point: "arteria dorsalis pedes"
- Reference_point: "arteria tibialis posterior"
- Non-query-able: "informed consent"
- Post-eligibility: "informed consent"